Clinical trial exclusion criterion:
Abnormal renal function as evidenced by a calculated creatinine clearance < 30 ml/minute.

Annotated entities:
- Measurement: "renal function"
- Value: "Abnormal"
- Measurement: "calculated creatinine clearance"
- Value: "< 30 ml/minute"